63歲男性為HBV帶原者。5年前開始有兩手小關節、手腕、手肘、膝蓋及腳踝關節酸痛，抽血檢查發現RF：29.7 IU/mL（normal< 10 IU/mL），ESR：18 mm/1h，CRP：1.0 mg/dL （normal<0.8 mg/dL），ALT：62 U/L。下列何種檢查結果陽性對患者的鑑別診斷最有幫助？
A. anti-nuclear antibody
B. anti-SSA/anti-SSB antibody
C. anti-cyclic citrullinated peptide antibody
D. C3 and C4

正確答案：C. anti-cyclic citrullinated peptide antibody